What is the mode of inheritance of short QT syndrome?

The short QT syndrome has an autosomal dominant mode of inheritance.